32 歲男性病人，因最近一星期刷牙容易出血且不易停止，就醫抽血檢查發現血紅素、白血球及血小板均嚴重不足，經骨髓切片發現幾無造血細胞存在。請問該病人最有可能是服用下列何種藥物所引起的？
A. Acetaminophen
B. Indomethacin
C. Chloramphenicol
D. Hydralazine

正確答案：C. Chloramphenicol